Un electrodo de calomelanos:
1. Es un electrodo indicador de mercurio.
2. Es un electrodo de referencia que contiene iones nitrato.
3. Es un electrodo indicador para iones nitrato.
4. Es un electrodo de referencia que utiliza plata y cloruro de plata.
5. Es un electrodo de referencia que contiene una solución saturada de cloruro de mercurio (I).

Respuesta correcta: 5. Es un electrodo de referencia que contiene una solución saturada de cloruro de mercurio (I).